下列何者最不適合作為下肢表面解剖學的標記？
A. 脛骨粗隆（tibial tuberosity）
B. 脛骨內髁（medial malleolus）
C. 腓骨外髁（lateral malleolus）
D. 腓骨骨幹外側的中間 1/3

正確答案：D. 腓骨骨幹外側的中間 1/3